69 歲女性服用感冒藥後因噁心、嘔吐、頭痛、左眼視力模糊且疼痛至急診室求診，身體檢查發現瞳孔中度散大、前房變淺、角膜混濁不清，此病患最可能之主要診斷為：
A. 急性結膜炎
B. 急性隅角閉鎖性青光眼
C. 病毒性角膜炎
D. 急性虹彩炎

正確答案：B. 急性隅角閉鎖性青光眼